Clinical trial inclusion criterion:
IVF/ICSI fertilisation

Entity relations:
- OR("IVF fertilisation", "ICSI fertilisation")